常見造成急性鼻竇炎的病原體中，何種細菌常是源自牙齒的感染？
A. 肺炎鏈球菌
B. 流行性感冒嗜血桿菌
C. 金黃色葡萄球菌
D. 厭氧菌

正確答案：D. 厭氧菌